What is the mode of inheritance of Facioscapulohumeral muscular
dystrophy (FSHD)?

The mode of inheritance of Facioscapulohumeral muscular dystrophy is autosomal dominant.